48歲男性罹患高血壓多年，沒有規則服藥。在工作中，突然感覺右臂、右腿及右臉麻木（numbness），但沒有明顯的無力（weakness），最可能的病灶位置（lesion site）在何處？
A. 右側丘腦（right thalamus）
B. 左側丘腦（left thalamus）
C. 右側中央溝前側腦迴（right precentral gyrus）
D. 左側中央溝前側腦迴（left precentral gyrus）

正確答案：B. 左側丘腦（left thalamus）